Clinical trial inclusion criterion:
first upper GI endoscopy procedure

Entity relations:
- Has_qualifier("endoscopy procedure", "upper GI")
- Has_multiplier("endoscopy procedure", "first")